Clinical trial exclusion criterion:
any medical condition that would contraindicate use of stimulant medication

Entity relations:
- AND("contraindicate", "stimulant medication")
- AND("medical condition", "contraindicate")